Application in the last 7 days at the site of injection of local treatments (apart emollients or antiseptics) or injections of botulism toxin or dynamic phototherapy or laser in the last 6 months.

The above is a clinical trial exclusion criterion. Annotated with entity spans:
[Procedure: Application] [Temporal: in the last 7 days] at the site of injection of local treatments ([Negation: apart] [Drug: emollients] or [Drug: antiseptics]) or [Procedure: injections] of [Drug: botulism toxin] or [Procedure: dynamic phototherapy] or [Procedure: laser] [Temporal: in the last 6 months].